肝癌患者有下列何種狀況不適合手術切除？
A. 有肝硬化
B. 腫瘤大於10公分
C. 有腹水無法用利尿劑控制
D. 有末梢門脈血栓

正確答案：C. 有腹水無法用利尿劑控制